Clinical trial inclusion criterion:
Life expectancy ≥ 3 months

Annotated entities:
- Measurement: "Life expectancy"
- Value: "≥ 3 months"